mNeff 0 acute diverticulitis (abdominal computed tomography scan)

The above is a clinical trial inclusion criterion. Annotated with entity spans:
[Measurement: mNeff] [Value: 0] [Qualifier: acute] [Condition: diverticulitis] ([Procedure: abdominal computed tomography scan])